mRS before the autoimmune encephalitis > 3

The above is a clinical trial exclusion criterion. Annotated with entity spans:
[Measurement: mRS] [Temporal: before the autoimmune encephalitis] [Value: > 3]